Clinical trial exclusion criteria:
Pregnancy and breast feeding mother;
Estimated life expectancy <12 months;
Scheduled major surgery in the next 6 months;
Inability to follow the protocol and comply with follow-up requirements or any other reason that the investigator feels would place the patient at increased risk;
Previous enrolment in this study or treatment with an investigational drug or device under another study protocol in the past 30 days.
WHO group II, III, IV, V PH
Severe Renal dysfunction (Ccr<30 ml/min)
Blood platelet count<100,000/L
Expected life span<6-month
Systematical inflammation
Malignant cancer(s)
Tricuspid valve stenosis, Supra-pulmonary valve stenosis
Allergic to studied drugs or metal materials.

Annotated entities:
- Condition: "Pregnancy"
- Observation: "breast feeding"
- Observation: "Estimated life expectancy"
- Value: "<12 months"
- Mood: "Scheduled"
- Procedure: "major surgery"
- Temporal: "in the next 6 months"
- Observation: "Inability to follow the protocol"
- Observation: "Inability to comply with follow-up requirements"
- Temporal: "Previous"
- Procedure: "treatment with an investigational drug"
- Drug: "investigational drug"
- Observation: "enrolment in this study"
- Device: "device"
- Measurement: "WHO"
- Value: "group II, III, IV, V"
- Condition: "PH"
- Condition: "Renal dysfunction"
- Qualifier: "Severe"
- Measurement: "Ccr"
- Value: "<30 ml/min"
- Measurement: "Blood platelet count"
- Value: "<100,000/L"
- Observation: "Expected life span"
- Value: "<6-month"
- Condition: "Systematical inflammation"
- Condition: "Malignant cancer"
- Condition: "Tricuspid valve stenosis"
- Condition: "Supra-pulmonary valve stenosis"
- Condition: "Allergic"
- Drug: "studied drugs"
- Drug: "studied metal materials"